11. Systolic blood pressure < 90mmHg, or > 160mmHg;

The above is a clinical trial exclusion criterion. Annotated with entity spans:
11. Systolic [Measurement: blood pressure] [Value: < 90mmHg], or [Value: > 160mmHg];